Received more than one primary chemotherapy regimen.

The above is a clinical trial exclusion criterion. Annotated with entity spans:
Received [Multiplier: more than one] [Drug: primary chemotherapy regimen].